Clinical trial inclusion criterion:
Males or non-pregnant, non-nursing females between the ages of 2-65 years

Annotated entities:
- Person: "Males"
- Pregnancy_considerations: "non-pregnant, non-nursing"
- Person: "females"
- Person: "ages"
- Value: "2-65 years"